Clinical trial inclusion criterion:
Men between 45 and 80 years age

Annotated entities:
- Person: "Men"
- Value: "between 45 and 80 years"
- Person: "age"